Clinical trial exclusion criterion:
Current treatment with cholestyramine or cholestipol resins

Entity relations:
- Has_temporal("cholestyramine", "Current")
- Has_temporal("cholestipol resins", "Current")
- OR("cholestyramine", "cholestipol resins")